下列何者構成弓狀線（arcuate line）下方腹直肌前的鞘膜（rectus sheath anterior to the rectus abdominis）？ ①Scarpa's fascia ②腹外斜肌（external abdominal oblique muscle）的腱膜（aponeurosis） ③腹內斜肌（internal abdominal oblique muscle）的腱膜 ④腹橫肌（transversus abdominis）的腱膜
A. ①
B. 僅②
C. 僅②③
D. ②③④

正確答案：D. ②③④